從病患肺部中取出之檢體切片經 Periodic acid-Schiff（PAS）染色後，發現許多紫紅色之寬闊帶狀（Broad, ribbon-like），無隔膜菌絲（Coenocytic hyphae）穿過組織，診斷上極可能推向是那一種真菌疾病？
A. 新型隱球菌症（Cryptococcosis）
B. 麴菌症（Aspergillosis）
C. 孢子絲菌症（Sporotrichosis）
D. 接合菌症（Zygomycosis）

正確答案：D. 接合菌症（Zygomycosis）